Es una citocina Th1:
1. IL-1.
2. IL-2.
3. IL-3.
4. IL-4.
5. IL-5.

Respuesta correcta: 2. IL-2.